Clinical trial inclusion criterion:
3. Physician and patient have agreed to initiate Lysteda

Annotated entities:
- Drug: "Lysteda"
- Non-query-able: "Physician and patient have agreed to initiate Lysteda"